下列何種細菌毒素引起之腹瀉作用與 cAMP 之增加有關？
A. Cholera toxin
B. E. Coli heat-stable toxin
C. Botulinum toxin
D. Pertussis toxin

正確答案：A. Cholera toxin